Subject must be able to read in a language supported by the smart phone app in their region.

The above is a clinical trial inclusion criterion. Annotated with entity spans:
[Non-query-able: Subject must be able to read in a language supported by the smart phone app in their region.]